Clinical trial exclusion criterion:
History of acute or chronic pancreatitis

Entity relations:
- OR("acute pancreatitis", "chronic pancreatitis")